下列各種抗結核藥物與常見副作用的組合，何者錯誤？
A. Isoniazid－hepatitis
B. Ethambutol－optic neuritis
C. Rifampin－hyperuricemia
D. Pyrazinamide－hepatitis

正確答案：C. Rifampin－hyperuricemia